Clinical trial inclusion criterion:
The patient receive no anti-cancer treatment before primary surgery.

Entity relations:
- Has_index("before primary surgery", "primary surgery")
- Has_temporal("anti-cancer treatment", "before primary surgery")
- Has_negation("anti-cancer treatment", "no")